一位10個月大的女嬰得了川崎症，而接受高劑量靜脈免疫球蛋白治療。有關她之後的預防接種，下列何者錯誤？
A. 1歲大時接種水痘疫苗
B. 1歲3個月接種日本腦炎疫苗
C. 1歲6個月接種白喉、非細胞性百日咳、破傷風、小兒麻痺、b型嗜血桿菌五合一疫苗
D. 流感季可施打流感疫苗

正確答案：A. 1歲大時接種水痘疫苗